Steroids other than methylprednisolone or prednisone

The above is a clinical trial exclusion criterion. Annotated with entity spans:
[Drug: Steroids] [Negation: other than] [Drug: methylprednisolone] or [Drug: prednisone]